Clinical trial exclusion criterion:
chronic pancreatitis

Entity relations:
- Has_multiplier("pancreatitis", "chronic")